Clinical trial exclusion criterion:
Patients who have received any other investigational drug or device within 3 months;

Annotated entities:
- Competing_trial: "Patients who have received any other investigational drug or device within 3 months;"